Clinical trial exclusion criterion:
Administration of doxycycline, azithromycin, chloramphenicol, rifampicin, or tetracycline during the preceding 7 days

Entity relations:
- Has_temporal("doxycycline", "during the preceding 7 days")
- OR("doxycycline", "rifampicin", "chloramphenicol", "azithromycin", "tetracycline")